Pregnant or nursing females, or plan to become pregnant or nurse during the study period

The above is a clinical trial exclusion criterion. Annotated with entity spans:
[Condition: Pregnant] or [Observation: nursing] [Person: females], or [Mood: plan to] [Observation: become pregnant] or [Observation: nurse] [Temporal: during the study period]